Clinical trial inclusion criterion:
19-65 years of age

Entity relations:
- Has_value("age", "19-65 years")